Clinical trial exclusion criterion:
<18 years old

Entity relations:
- Has_value("old", "<18 years")